El mesna (2-mercaptoetanosulfonato sódico) se utiliza junto a la ciclofosfamida en la terapia antitumoral porque:
1. Forman un complejo ternario con el ADN que impide la replicación.
2. El mesna inactiva un metabolito tóxico que resulta de la activación del ciclofosfamida.
3. Los dos son agentes alquilantes del ADN.
4. Las propiedades oxidantes del mesna incrementan la citotoxicidad de la ciclofosfamida.
5. El mesna inhibe el citocromo P-450 que oxida y degrada la ciclofosfamida.

Respuesta correcta: 2. El mesna inactiva un metabolito tóxico que resulta de la activación del ciclofosfamida.